Enrolled in the Cystic Fibrosis Foundation National Patient Registry (CFFNPR) prior to Visit 1 (US sites only)

The above is a clinical trial inclusion criterion. Annotated with entity spans:
[Observation: Enrolled in the Cystic Fibrosis Foundation National Patient Registry (CFFNPR)] [Temporal: prior to Visit 1] ([Visit: US sites] only)